Presence of sliding hiatus hernia as defined by flap valve grade IV disruption of morphology at gastro-esophageal junction

The above is a clinical trial exclusion criterion. Annotated with entity spans:
Presence of [Qualifier: sliding] [Condition: hiatus hernia] as defined by [Measurement: flap valve] [Value: grade IV] disruption of morphology [Qualifier: at gastro-esophageal junction]